一位 15 歲的男生，兩年來一直有反覆大量流鼻血現象，左側亦有中耳積水，頸部無硬塊發現，最有可能的疾患為何？
A. 鼻咽癌
B. 鼻腔癌
C. 鼻中隔前下方 Little area 流血
D. 鼻咽血管纖維瘤

正確答案：D. 鼻咽血管纖維瘤